Clinical trial exclusion criteria:
Pregnancy, coagulopathy, allergy to bupivacaine, renal failure, hepatic insufficiency, and/or inappropriate candidate for usual therapy (specifically, if unable to receive the usual preoperative interscalene nerve block: preexisting nerve injury on side of surgery, refusal of nerve block, infection at site of nerve block).

Annotated entities:
- Condition: "Pregnancy"
- Condition: "coagulopathy"
- Condition: "allergy"
- Drug: "bupivacaine"
- Condition: "renal failure"
- Condition: "hepatic insufficiency"
- Condition: "inappropriate candidate"
- Procedure: "usual therapy"
- Mood: "unable to receive"
- Procedure: "preoperative interscalene nerve block"
- Temporal: "preexisting"
- Condition: "nerve injury"
- Qualifier: "side of surgery"
- Condition: "refusal of nerve block"
- Condition: "infection"
- Qualifier: "site of nerve block"